下列有關前庭系統（vestibular system）之敘述，何者錯誤？
A. 前庭膜性迷路（membranous labyrinth）包括三個半規管（semicircular ducts）、橢圓囊（utricle）和球囊（saccule）
B. 三個半規管之感覺接受器位於膨大之壺腹（ampulla）處，稱為斑（macula）；橢圓囊和球囊之感覺接受器為嵴（crista）
C. 嵴負責感知角加速度（angular acceleration），斑負責感知線加速度（linear acceleration）
D. 左右兩側之半規管形成功能上之配對，當頭部運動導致一側接受器興奮時，對側接受器會受到抑制

正確答案：B. 三個半規管之感覺接受器位於膨大之壺腹（ampulla）處，稱為斑（macula）；橢圓囊和球囊之感覺接受器為嵴（crista）